Clinical trial exclusion criterion:
14. Previous or current radiation therapy or likelihood to receive this therapy during study participation

Annotated entities:
- Parsing_Error: "14."
- Procedure: "radiation therapy"
- Non-query-able: "likelihood to"
- Subjective_judgement: "likelihood to"
- Temporal: "Previous"
- Temporal: "current"